Clinical trial inclusion criterion:
Not planned for discharge within 60 hours of study entry

Entity relations:
- Has_mood("discharge", "planned")
- Has_temporal("discharge", "within 60 hours of study entry")
- AND("discharge", "Not")
- Has_index("within 60 hours of study entry", "study entry")